Una partícula cargada en disolución se mueve cuando se sitúa en un campo eléctrico. La velocidad adquirida por el soluto bajo la influencia del voltaje aplicado es el producto de la movilidad aparente del soluto y el campo aplicado. En lo que se refiere a dicha movilidad, se puede afirmar que:
1. Una partícula neutra de pequeño tamaño tendrá una movilidad menor que otra neutra de gran tamaño.
2. Un polímero macromolecular tendrá mayor movilidad que el correspondiente monómero.
3. Una partícula grande con una carga pequeña tendrá gran movilidad.
4. Una partícula pequeña de gran carga tendrá gran movilidad.
5. Una micela con cargas tendrá menor movilidad que otra micela del mismo tamaño pero neutra.

Respuesta correcta: 4. Una partícula pequeña de gran carga tendrá gran movilidad.